Clinical trial inclusion criterion:
At least one measurable lesion;

Entity relations:
- Has_multiplier("lesion", "At least one")